Clinical trial exclusion criterion:
hypogonadotropic hypogonadism,

Annotated entities:
- Condition: "hypogonadotropic hypogonadism"